Clinical trial exclusion criterion:
Hepatitis B infection.

Annotated entities:
- Condition: "Hepatitis B infection"